Clinical trial inclusion criterion:
Any therapy by intra-articular injections (e.g. corticosteroid) within 4 weeks before baseline

Annotated entities:
- Procedure: "intra-articular injections"
- Drug: "corticosteroid"
- Temporal: "within 4 weeks before baseline"